Clinical trial exclusion criterion:
Patients who are expected to need systemic antiviral therapy other than that provided by the study at any time during their participation in the study are also excluded. Exception: patients who have had a limited (<=7 days) course of acyclovir for herpetic lesions more than 1 month prior to the first administration of test drug are not excluded.

Entity relations:
- Has_mood("systemic antiviral therapy", "expected to need")
- Has_temporal("systemic antiviral therapy", "at any time during their participation in the study")
- Has_index("at any time during their participation in the study", "their participation in the study")
- Subsumes("limited course", "<=7 days")
- Has_multiplier("acyclovir", "limited course")
- Has_index("more than 1 month prior to the first administration of test drug", "the first administration of test drug")
- AND("acyclovir", "herpetic lesions")
- Has_temporal("acyclovir", "more than 1 month prior to the first administration of test drug")
- Has_mood("acyclovir", "not excluded")
- Has_negation("acyclovir", "Exception")